Clinical trial exclusion criterion:
Known platelets < 100.000/µl or known hemorrhagic diathesis

Annotated entities:
- Measurement: "platelets"
- Value: "< 100.000/µl"
- Condition: "hemorrhagic diathesis"